Indica cuales de los siguientes es un Delirio Primario según Jaspers:
1. Intuición delirante.
2. Control delirante.
3. Ritual delirante.
4. Crisis delirante.
5. Obsesión delirante.

Respuesta correcta: 1. Intuición delirante.